Clinical trial inclusion criteria:
Age > 18 years
Presumed AJCC (American Joint Committee on Cancer) tumor Stage I or II
Planned total or near-total thyroidectomy
Planned goal TSH suppression 0.1-0.5 mU/L for at least 18 weeks postoperatively
Normal serum TSH within 12 months preceding surgery

Annotated entities:
- Person: "Age"
- Value: "> 18 years"
- Measurement: "AJCC tumor Stage I"
- Measurement: "American Joint Committee on Cancer"
- Value: "I"
- Value: "II"
- Procedure: "thyroidectomy"
- Qualifier: "total"
- Qualifier: "near-total"
- Temporal: "at least 18 weeks postoperatively"
- Reference_point: "postoperatively"
- Condition: "TSH suppression"
- Value: "0.1-0.5 mU/L"
- Measurement: "serum TSH"
- Value: "Normal"
- Temporal: "within 12 months preceding surgery"
- Reference_point: "surgery"